有關單純型熱性痙攣（simple febrile seizure）的敘述，下列何者錯誤？
A. 可發生在發展正常的幼兒
B. 家族中有熱性痙攣病史的機率較一般人高
C. 重複發作的病兒須長期服用癲癇藥物
D. 抽搐發作時間少於15分鐘

正確答案：C. 重複發作的病兒須長期服用癲癇藥物